Clinical trial exclusion criteria:
HCV, HIV, HDV coinfection.
Uncontrolled HCC, malignancy or decompensated liver cirrhosis (CTP score = 7).
Uremia patients or Creatinine = 2 mg/dl.

Annotated entities:
- Condition: "HCV coinfection"
- Condition: "coinfection HIV"
- Condition: "HDV coinfection"
- Condition: "HCC"
- Condition: "malignancy"
- Condition: "liver cirrhosis"
- Qualifier: "decompensated"
- Qualifier: "Uncontrolled"
- Measurement: "CTP score"
- Value: "= 7"
- Condition: "Uremia"
- Measurement: "Creatinine"
- Value: "= 2 mg/dl"